¿En qué Tipo (nivel 4) de Eysenck se incluyen los rasgos (nivel 3) “agresivo, frío, egocéntrico, impersonal e impulsivo”?
1. Extraversión.
2. Neuroticismo.
3. Estabilidad.
4. Introversión.
5. Psicoticismo.

Respuesta correcta: 5. Psicoticismo.